Serum albumin < 2.0mg/dL

The above is a clinical trial exclusion criterion. Annotated with entity spans:
[Measurement: Serum albumin] [Value: < 2.0mg/dL]